What is Soluvia?

Soluvia(tm) by Becton Dickinson is a microinjection system for intradermal delivery of vaccines.